Allergy to pivmecillinam

The above is a clinical trial exclusion criterion. Annotated with entity spans:
[Condition: Allergy] to [Drug: pivmecillinam]